What animal is thought to be the host for the Coronavirus causing MERS?

The animal thought to be the host for the Coronavirus causing MERS is camels.